35 歲女性由於高血鈣而接受副甲狀腺的手術。病理檢查證實病變具有完整包被。顯微鏡下病變由 chief cell 組成，細胞中沒有出現有絲分裂的形態。在包被外的邊緣尚可見殘存一圈正常副甲狀腺的組織。 下列副甲狀腺疾病中，何者最符合此病人的臨床及病理特徵？
A. Primary hyperplasia
B. Secondary hyperplasia
C. Adenoma
D. Carcinoma

正確答案：C. Adenoma